Clinical trial exclusion criterion:
Acute coronary syndrome within 1 month

Entity relations:
- Has_temporal("Acute coronary syndrome", "within 1 month")